Clinical trial exclusion criterion:
Clinically relevant active bleeding

Annotated entities:
- Condition: "active bleeding"